Clinical trial inclusion criteria:
Patient's written informed consent. Adequate cognitive capacity.
Adequate family support
No acute diverticulitis episode in the last 3 months
mNeff 0 acute diverticulitis (abdominal computed tomography scan)
No antibiotic treatment in the last 2 weeks
Immunocompetence*
No significant comorbidities**
Good oral tolerance
Good symptom control
Maximum one of the following SIRS criteria (* T>38 ºC or <36ºC, L>12,000 or <4000/uL, HR>90 bpm, RR<20 rpm) or CRP>15 mg/dL

Annotated entities:
- Post-eligibility: "Patient's written informed consent. Adequate cognitive capacity"
- Subjective_judgement: "Adequate family support"
- Condition: "diverticulitis"
- Qualifier: "acute"
- Temporal: "in the last 3 months"
- Measurement: "mNeff"
- Value: "0"
- Condition: "diverticulitis"
- Qualifier: "acute"
- Procedure: "abdominal computed tomography scan"
- Drug: "antibiotic treatment"
- Temporal: "in the last 2 weeks"
- Negation: "No"
- Condition: "Immunocompetence"
- Condition: "comorbidities"
- Negation: "No"
- Qualifier: "significant"
- Condition: "oral tolerance"
- Qualifier: "Good"
- Condition: "symptom control"
- Qualifier: "Good"
- Measurement: "SIRS criteria"
- Measurement: "T"
- Value: ">38 ºC"
- Value: "<36ºC"
- Measurement: "L"
- Value: ">12,000 /uL"
- Value: "<4000/uL"
- Measurement: "HR"
- Value: ">90 bpm"
- Measurement: "RR"
- Value: "<20 rpm"
- Measurement: "CRP"
- Value: ">15 mg/dL"